Clinical trial inclusion criterion:
Complex kidney stone (staghorn calculi GUYS III and IV)

Entity relations:
- Has_value("GUYS", "III and IV")
- AND("staghorn calculi", "GUYS")
- AND("Complex kidney stone", "staghorn calculi")